La técnica de exposición interoceptiva es propia de los programas de intervención para:
1. La ansiedad generalizada.
2. La fobia a la sangre.
3. El trastorno obsesivo compulsivo.
4. El trastorno de pánico.

Respuesta correcta: 4. El trastorno de pánico.